Pericarditis

The above is a clinical trial exclusion criterion. Annotated with entity spans:
[Condition: Pericarditis]